Clinical trial exclusion criterion:
taking part in other clinical trials;

Annotated entities:
- Competing_trial: "taking part in other clinical trials"